精索靜脈曲張百分之九十發生在男性的左側陰囊是因為左睪丸靜脈回流至：
A. 下腔靜脈（Inferior vena cava）
B. 左側的腎靜脈（Renal vein）
C. 左側的髂靜脈（Iliac vein）
D. 左側的股靜脈（Femoral vein）

正確答案：B. 左側的腎靜脈（Renal vein）